no history of allergy to drugs such as, but not limited to, sulphonamides and penicillins

The above is a clinical trial exclusion criterion. Annotated with entity spans:
no [Temporal: history] of [Condition: allergy] to drugs such as, but not limited to, [Drug: sulphonamides] and [Drug: penicillins]